Allergy or sensitivity to corticosteroids or any drug hypersensitivity or intolerance that would compromise patient safety or study results

The above is a clinical trial exclusion criterion. Annotated with entity spans:
[Condition: Allergy] or [Condition: sensitivity] to [Qualifier: corticosteroids] or any [Condition: drug hypersensitivity] or intolerance t[Subjective_judgement: hat would compromise patient safety or study results]